El sistema en T:
1. Está presente en todas las células musculares sin excepción.
2. Forma parte del retículo sarcoplásmico.
3. Posee una ATPasa activada por Ca2+.
4. Es una invaginación tubular de la membrana plásmica.
5. Libera Ca2+ al citosol durante la contratación.

Respuesta correcta: 4. Es una invaginación tubular de la membrana plásmica.